Clinical trial exclusion criterion:
Other tumor type than adenocarcinoma

Entity relations:
- Has_negation("adenocarcinoma", "Other")
- AND("tumor", "adenocarcinoma")